Clinical trial inclusion criterion:
Diagnosis of sickle cell disease

Entity relations:
- Has_mood("sickle cell disease", "Diagnosis")